Clinical trial exclusion criterion:
Severe impairment of liver or pancreatic function.

Entity relations:
- Has_qualifier("impairment of liver", "Severe")
- OR("impairment of liver", "impairment of pancreatic function")